一位 60 歲男性病人因腹部腫脹住院，超音波檢查發現腹水並做診斷性引流，腹水分析結果白血球數 0 g/dL，白蛋白值為 1.2 g/dL；血清白蛋白值為 2.6 g/dL，下列何者為最可能的診斷？
A. 心臟衰竭（Congestive heart failure）
B. 結核性腹膜炎（Tuberculous peritonitis）
C. 腹膜癌症（Neoplasm）
D. 細菌性腹膜炎（Pyogenic peritonitis）

正確答案：A. 心臟衰竭（Congestive heart failure）